Patients with a diagnosis of osteoarthritis, traumatic arthritis, or avascular necrosis

The above is a clinical trial inclusion criterion. Annotated with entity spans:
Patients with a diagnosis of [Condition: osteoarthritis], [Condition: traumatic arthritis], or [Condition: avascular necrosis]